Clinical trial exclusion criterion:
Female patients with androgenetic alopecia.

Annotated entities:
- Person: "Female"
- Condition: "androgenetic alopecia"